Clinical trial exclusion criterion:
Language barrier

Annotated entities:
- Non-query-able: "Language barrier"